En la Terapia Cognitiva de Beck los pensamientos automáticos son considerados:
1. Un esquema.
2. Un proceso cognitivo.
3. Una guía de acción.
4. Una interferencia.
5. Un producto cognitivo.

Respuesta correcta: 5. Un producto cognitivo.